Emergency surgery needed

The above is a clinical trial exclusion criterion. Annotated with entity spans:
[Procedure: Emergency surgery] [Mood: needed]